presence of subacute or chronic DVT more than 21 days in duration, inability to lie in the prone position required for intervention, terminal systemic disease requiring palliative treatment, active bleeding (from a gastric/duodenal ulcer or the cerebrovascular system), a haemorrhagic stroke within the previous year, an impaired bleeding-clotting profile, and any haemophilic disorder, or pregnancy.

The above is a clinical trial exclusion criterion. Annotated with entity spans:
presence of [Qualifier: subacute] or [Qualifier: chronic] [Condition: DVT] [Multiplier: more than 21 days in duration], [Condition: inability to lie in the prone position] [Non-representable: required for intervention], [Condition: terminal systemic disease] [Mood: requiring] [Procedure: palliative treatment], [Qualifier: active] [Condition: bleeding] (from a [Condition: gastric]/[Condition: duodenal ulcer] or the [Qualifier: cerebrovascular system]), a [Condition: haemorrhagic stroke] [Temporal: within the previous year], an [Condition: impaired bleeding-clotting profile], and any [Condition: haemophilic disorder], or [Condition: pregnancy].